Nemolizumab has been shown to be effective for which disease?

Nemolizumab has been shown to be effective for atopic dermatitis.